Describe armoured brain syndrome.

Armoured brain syndrome is defined by calcified chronic subdural haematoma.